Clinical trial exclusion criterion:
Non perforated corneal ulcer

Annotated entities:
- Qualifier: "Non perforated"
- Condition: "corneal ulcer"